Life expectancy of at least 12 months as per the investigator's judgement

The above is a clinical trial inclusion criterion. Annotated with entity spans:
[Observation: Life expectancy] of [Value: at least 12 months] as per the investigator's judgement